Clinical trial inclusion criterion:
Have a CD4 cell count greater than 50 cells/mm3if not taking ART. Persons with cd4 < 50 may be enrolled, if it is felt that in the best interest of the patient, that enrollment in the study will allow for quicker initiation of antiretroviral therapy than referral to another treatment center.

Annotated entities:
- Measurement: "CD4 cell count"
- Value: "greater than 50 cells/mm3"
- Procedure: "ART"
- Negation: "not"